Clinical trial inclusion criterion:
Patients presenting for abdominal myomectomy with documented uterine fibroids on pelvic imaging (pelvic ultrasound or MRI) within in last 12 months

Annotated entities:
- Procedure: "abdominal myomectomy"
- Condition: "uterine fibroids"
- Procedure: "pelvic imaging"
- Procedure: "pelvic ultrasound"
- Procedure: "MRI pelvic"
- Temporal: "within in last 12 months"